Clinical trial exclusion criterion:
1. Taking a tetracycline within 6 months or history of adverse reaction to minocycline or another tetracycline.

Entity relations:
- Has_temporal("tetracycline", "within 6 months")
- AND("adverse reaction", "minocycline")
- Has_temporal("adverse reaction", "history")
- OR("minocycline", "tetracycline")